Clinical trial inclusion criterion:
Computerised Tomography (CT) scan of chest and abdomen within 28 days of starting pembrolizumab.

Entity relations:
- Has_index("within 28 days of starting pembrolizumab", "starting pembrolizumab")
- Has_temporal("Computerised Tomography (CT) scan of chest and abdomen", "within 28 days of starting pembrolizumab")